Women of childbearing potential who do not practice a medically accepted highly effective contraception during the trial and one month beyond

The above is a clinical trial exclusion criterion. Annotated with entity spans:
[Pregnancy_considerations: Women of childbearing potential who do not practice a medically accepted highly effective contraception during the trial and one month beyond]